Clinical trial inclusion criterion:
Have a CD4 cell count greater than 50 cells/mm3if not taking ART. Persons with cd4 < 50 may be enrolled, if it is felt that in the best interest of the patient, that enrollment in the study will allow for quicker initiation of antiretroviral therapy than referral to another treatment center.

Entity relations:
- Has_negation("ART", "not")
- Has_value("CD4 cell count", "greater than 50 cells/mm3")
- AND("ART", "CD4 cell count")